Patients with SOF/VEL treatment for the treatment of chronic HCV genotype 1 through 6.

The above is a clinical trial inclusion criterion. Annotated with entity spans:
Patients with [Procedure: SOF/VEL treatment] for the treatment of [Qualifier: chronic] [Measurement: HCV genotype] [Value: 1 through 6].